Any patient age 4-16 years with sickle cell disease who presents the Pediatric ER with acute sickle cell pain crisis with a pain of 6/10 or higher

The above is a clinical trial inclusion criterion. Annotated with entity spans:
Any patient [Person: age] [Value: 4-16 years] with [Condition: sickle cell disease] who presents the [Visit: Pediatric ER] with [Condition: acute sickle cell pain crisis] with a [Measurement: pain] of [Value: 6/10 or higher]